一位 32 歲貨車司機，在高速公路發生追撞前車的車禍，在急診疑似心臟損傷，下列敘述何者錯誤？
A. 心肌挫傷的診斷完全可藉由心電圖與血清中心肌酵素值來確定
B. 持續心搏過速常常是心肌挫傷的早期徵候
C. 心包膜填塞可以發生在車禍後的第 4 天
D. 持續心電圖變化或 Q 波可以指出 transmural injury

正確答案：A. 心肌挫傷的診斷完全可藉由心電圖與血清中心肌酵素值來確定